Clinical trial exclusion criterion:
has a history of taste or smell loss or other oral disorders (e.g., burning mouth syndrome)

Entity relations:
- Has_qualifier("oral disorders", "other")
- Subsumes("oral disorders", "burning mouth syndrome")
- Has_temporal("taste loss", "history")
- OR("taste loss", "oral disorders", "smell loss")